Clinical trial exclusion criterion:
History of drug or alcohol abuse within the 12 months prior to dosing.

Annotated entities:
- Temporal: "History"
- Condition: "drug abuse"
- Condition: "alcohol abuse"
- Temporal: "within the 12 months prior"